Clinical trial inclusion criterion:
Diabetic and nondiabetic patients

Entity relations:
- OR("Diabetic", "nondiabetic")